Clinical trial exclusion criterion:
known allergies for tranexamic acid or any other substance in Exacyl

Annotated entities:
- Condition: "allergies"
- Drug: "tranexamic acid"
- Drug: "Exacyl"